下列何者為支配陰囊前側邊的神經？
A. 股神經
B. 陰部神經
C. 股後皮神經
D. 髂腹股溝神經

正確答案：D. 髂腹股溝神經